List clinical features of EEM syndrome.

EEM syndrome is characterized by ectodermal dysplasia, ectrodactyly and macular dystrophy.